Clinical trial exclusion criterion:
not diabetic patient;

Entity relations:
- Has_negation("diabetic", "not")